Clinical trial exclusion criterion:
Any diagnosed cardiovascular, pulmonary, neurological, and/ or orthopedic conditions that would interfere with subject participation

Annotated entities:
- Condition: "cardiovascular conditions"
- Condition: "pulmonary conditions"
- Condition: "neurological conditions"
- Condition: "orthopedic conditions"
- Qualifier: "interfere with subject participation"
- Undefined_semantics: "interfere with subject participation"
- Subjective_judgement: "interfere with subject participation"